Clinical trial exclusion criterion:
15. Concomitant administration of any prescription or over the counter medications known to be highly dependent on P450 or P-gp for clearance for which elevated plasma concentrations are known to be associated with serious toxicity

Entity relations:
- Has_value("plasma concentrations", "elevated")
- Has_temporal("medications known to be highly dependent on P450 for clearance", "Concomitant")
- Has_qualifier("toxicity", "serious")
- AND("medications known to be highly dependent on P450 for clearance", "plasma concentrations")
- AND("plasma concentrations", "toxicity")
- OR("medications known to be highly dependent on P450 for clearance", "medications known to be highly dependent on P-gp for clearance")